有關川崎氏症（Kawasaki disease）的治療考量，下列何者最為正確？
A. 以免疫球蛋白（IVIG）2 g/kg為主要之治療
B. 使用高劑量Aspirin（80～100 mg/kg/day）是為了抗凝血作用
C. 使用低劑量Aspirin（3～5 mg/kg/day）是為了抗發炎作用
D. 高燒時需用第三線抗生素以預防感染

正確答案：A. 以免疫球蛋白（IVIG）2 g/kg為主要之治療